Clinical trial exclusion criterion:
Septic or hypovolemic shock

Entity relations:
- OR("Septic shock", "hypovolemic shock")